Clinical trial exclusion criterion:
Liver disease caused by an etiology other than HCV

Entity relations:
- Has_negation("HCV", "other")